Disponemos de dos tests para diagnosticar una enfermedad de pronóstico grave. La prueba A tiene una sensibilidad del 95% y una especificidad del 60% y la prueba B tiene una sensibilidad del 70% y una especificidad del 99%. Disponemos de un tratamiento eficaz pero que produce efectos adversos importantes y además tiene un coste muy elevado. ¿Qué prueba elegiríamos para hacer el diagnóstico?
1. La prueba A porque detectará menos falsos positivos.
2. La prueba A porque tiene una sensibilidad mayor.
3. La prueba B porque detectará más falsos positivos.
4. La prueba A porque detectará más falsos negativos.
5. La prueba B porque tiene una mayor especificidad.

Respuesta correcta: 5. La prueba B porque tiene una mayor especificidad.